下列敘述，何者正確？
A. 植入物（prosthesis）相關的感染通常發生在肺部
B. 手術後發燒需立即給予抗生素
C. 尿路感染（urinary tract infection）是手術後最常見的非手術感染（nonsurgical infection）
D. 選擇抗生素做經	性治療（empirical treatment）時，最好是同時使用抗厭氧菌的抗生素

正確答案：C. 尿路感染（urinary tract infection）是手術後最常見的非手術感染（nonsurgical infection）